Prior treatment with a bisphosphonate

The above is a clinical trial exclusion criterion. Annotated with entity spans:
[Temporal: Prior] treatment with a [Drug: bisphosphonate]